下列何種物質可經由轉氨基作用（transamination）直接合成glutamic acid？
A. α-ketoglutarate
B. pyruvate
C. acetoacetate
D. oxaloacetate

正確答案：A. α-ketoglutarate